早發性分娩（preterm labor）的定義，下列何者錯誤？
A. 一小時內有 5-8 次的規則宮縮（regular uterine contraction）
B. 子宮頸有漸近性的變化（progressive change）
C. 子宮頸擴張 2 公分以上或變薄程度（effacement）超過 80%以上
D. 下腹部疼痛

正確答案：D. 下腹部疼痛